Clinical trial inclusion criterion:
no clinical signs of infection

Entity relations:
- Has_negation("infection", "no")
- Has_mood("infection", "clinical signs of")